Subjects = 19 or = 75 years of age

The above is a clinical trial inclusion criterion. Annotated with entity spans:
Subjects [Value: = 19 or = 75 years] of [Person: age]